Clinical trial inclusion criteria:
Adult (=18 years)
Presence of intracranial aneurysm (with or without rupture)
Treating surgeon has recommended surgical repair of the aneurysm

Annotated entities:
- Person: "Adult"
- Value: "=18 years"
- Person: "years"
- Condition: "intracranial aneurysm"
- Qualifier: "without rupture"
- Qualifier: "with rupture"
- Procedure: "surgical repair"
- Condition: "aneurysm"
- Mood: "recommended"
- Qualifier: "Treating surgeon"